AUDIT score of > or equal to 5, < or equal to 26

The above is a clinical trial inclusion criterion. Annotated with entity spans:
[Measurement: AUDIT] [Value: score of > or equal to 5, < or equal to 26]